下列何者附	於脛骨粗隆（tibial tuberosity）？
A. 薦粗隆韌帶（sacrotuberous ligament）
B. 脛側副韌帶（tibial collateral ligament）
C. 腓側副韌帶（fibular collateral ligament）
D. 膝韌帶（patellar ligament）

正確答案：D. 膝韌帶（patellar ligament）